Clinical trial inclusion criterion:
Blood pressured controlled at 150/100 mHg following drug administration;

Entity relations:
- Has_value("Blood pressured", "150/100 mHg")
- Has_qualifier("Blood pressured", "controlled")